關於僵直性脊椎炎與脊椎骨折的關係，下列敘述何者正確？
A. 僵直性脊椎炎的脊椎較僵硬，故較一般人不易發生骨折
B. 僵直性脊椎炎的病人若發生脊椎骨折，因而產生脊髓損傷的比率較一般人低
C. 僵直性脊椎炎病人的脊椎骨折，其原因以車禍最常見
D. 僵直性脊椎炎病人的脊椎骨折以頸椎最常見

正確答案：D. 僵直性脊椎炎病人的脊椎骨折以頸椎最常見